Clinical trial exclusion criterion:
secondary hypertension

Annotated entities:
- Condition: "secondary hypertension"